Clinical trial inclusion criterion:
2. Cephalic presentation

Annotated entities:
- Parsing_Error: "2."
- Condition: "Cephalic presentation"